Clinical trial exclusion criterion:
For the RECAMP-MV trial: the child is enrolled in RECAMP-OPV

Entity relations:
- Has_context("RECAMP-MV trial", "enrolled in RECAMP-OPV")